一位病人發生車禍後造成單側足部下垂（drop foot），臨床上最不可能由下列那一種情況所引起？
A. 坐骨（sciatic）神經傷害
B. 股（femoral）神經傷害
C. 腓（peroneal）神經傷害
D. 第四第五腰椎間板突出（disc herniation）

正確答案：B. 股（femoral）神經傷害